Clinical trial exclusion criteria:
History of any malignancy or other severe diseases
Female patients who are pregnant or breastfeeding before or during the three-year follow-up
Poor compliance or refusal to participate.

Annotated entities:
- Condition: "malignancy"
- Condition: "severe diseases"
- Pregnancy_considerations: "Female patients who are pregnant or breastfeeding before or during the three-year follow-up"
- Observation: "Poor compliance"
- Observation: "refusal to participate"